Stable with < 20 mg prednisone (or equivalent) qd

The above is a clinical trial inclusion criterion. Annotated with entity spans:
[Condition: Stable] with [Multiplier: < 20 mg] [Drug: prednisone] (or equivalent) qd